Clinical trial exclusion criterion:
Inability to follow the protocol and comply with follow-up requirements or any other reason that the investigator feels would place the patient at increased risk;

Annotated entities:
- Observation: "Inability to follow the protocol"
- Observation: "Inability to comply with follow-up requirements"